inability to tolerate procedure due to hemodynamic instability or severe hypoxemia;

The above is a clinical trial exclusion criterion. Annotated with entity spans:
[Condition: inability to tolerate] [Procedure: procedure] due to [Condition: hemodynamic instability] or [Qualifier: severe] [Condition: hypoxemia];